Pre-existent neutropenia (neutrophils <1,500/mm3) or thrombocytopenia (platelets < 90,000/mm3)

The above is a clinical trial exclusion criterion. Annotated with entity spans:
[Qualifier: Pre-existent] [Condition: neutropenia] ([Measurement: neutrophils] [Value: <1,500/mm3]) or [Condition: thrombocytopenia] ([Measurement: platelets] [Value: < 90,000/mm3])